Hematologic function, as follows: Absolute neutrophil count (ANC) >=1.5 x 10^9/Liter (L), Platelet count >=75 x 10^9/L, Hemoglobin >=8.0 gram/deciliter (g/dL).

The above is a clinical trial inclusion criterion. Annotated with entity spans:
Hematologic function, as follows: [Measurement: Absolute neutrophil count (ANC)] [Value: >=1.5 x 10^9/Liter (L)], [Measurement: Platelet count] [Value: >=75 x 10^9/L], [Measurement: Hemoglobin] [Value: >=8.0 gram/deciliter (g/dL)].